您想要進行一種新材質的骨頭支架人體試驗，理論上這材質應該有很大的好處，沒有副作用，但是並沒有其他報告支持之。您的最佳對策為何？
A. 採取單盲實驗設計，使病人隨機接受新材質，不讓病人知道
B. 依照法令規定，提出試驗計畫書，經 IRB 通過後，取得病人知情同意
C. 只使用於沒有行為能力的重症患者
D. 清楚告訴病人，並取得其同意，就可以進行

正確答案：B. 依照法令規定，提出試驗計畫書，經 IRB 通過後，取得病人知情同意